Clinical trial exclusion criterion:
Claustrophobic patient unable to undergo the examination

Entity relations:
- Has_negation("examination", "unable")
- AND("Claustrophobic", "examination")